En el ámbito de la gestión, a la capacidad productiva de las personas que se manifiesta y se mide por su desempeño, reflejando los conocimientos, las habilidades, las actitudes y las destrezas para realizar un trabajo eficiente y efectivo, se le denomina:
1. Competencia.
2. Liderazgo.
3. Competitividad.
4. Cualificación.
5. Motivación.

Respuesta correcta: 1. Competencia.